Clinical trial inclusion criterion:
Normal renal function.

Entity relations:
- Has_qualifier("renal function", "Normal")